Clinical trial inclusion criterion:
Has undergone first time isolated CABG due to an episode of acute coronary syndrome (STEMI, NSTEMI, unstable angina) within 6 weeks before surgery

Entity relations:
- Has_index("within 6 weeks before surgery", "surgery")
- Subsumes("acute coronary syndrome", "STEMI")
- AND("isolated CABG", "acute coronary syndrome")
- Has_multiplier("isolated CABG", "first time")
- OR("STEMI", "NSTEMI", "unstable angina")